Clinical trial inclusion criterion:
Total weekly IgPro20 dose of = 50 mL (= 10 g).

Annotated entities:
- Qualifier: "weekly"
- Drug: "IgPro20"
- Multiplier: "= 50 mL"
- Multiplier: "= 10 g"